Clinical trial inclusion criterion:
CKD patients classified as Stage 3 and 4 of National Kidney Foundation Classification with estimated glomerular filtration rate (GFR) between 15 and 59 mL/min/1.73 m2 according to the Modification of Diet in Renal Disease (MDRD) formula based on serum creatinine, age, gender, and race.

Entity relations:
- Has_value("National Kidney Foundation Classification", "Stage 3")
- AND("CKD", "National Kidney Foundation Classification")
- Has_value("estimated glomerular filtration rate (GFR)", "between 15 and 59 mL/min/1.73 m2")
- Has_qualifier("estimated glomerular filtration rate (GFR)", "Modification of Diet in Renal Disease (MDRD) formula")
- OR("Stage 3", "Stage 4")